Clinical trial exclusion criterion:
State after kidney transplantation

Annotated entities:
- Condition: "State after kidney transplantation"
- Procedure: "kidney transplantation"